何種膽管囊腫最可能需要換肝？
A. TypeⅠ（Cystic dilatation of common bile duct）
B. TypeⅡ（Diverticulum from common bile duct）
C. TypeⅢ（Choledochocele）
D. Type V（Dilatation of intrahepatic duct）

正確答案：D. Type V（Dilatation of intrahepatic duct）